Clinical trial exclusion criterion:
Bilirubin greater than 2 times ULN.

Annotated entities:
- Measurement: "Bilirubin"
- Value: "greater than 2 times ULN"